Clinical trial inclusion criterion:
Patients must have undergone segmental mastectomy (i.e., lumpectomy).

Entity relations:
- Subsumes("segmental mastectomy", "lumpectomy")